下列何種分子是屬於 glycerophospholipid 並參與細胞內訊息傳遞？
A. arachidonic acid
B. vitamin C
C. phosphatidylinositol
D. phosphatidylethanolamine

正確答案：C. phosphatidylinositol